一位 28 歲初產婦，第一加第二產程總共 20 小時，最後以真空吸引方式產下體重 4200 g 男嬰。產後隨即施打退奶藥物。產後第 3 天開始有發燒現象，體溫 39.2℃，身體診查（含乳房及產道檢查）無異常發現，骨盆腔超音波檢查正常，血液學檢查（complete blood count）白血球數目略為增加，她除了 acetaminophen 之外並未使用其他藥物。接下來最適合優先進行下列何種檢查？
A. urinalysis and urine culture
B. breast sonography
C. blood culture
D. chest x ray

正確答案：A. urinalysis and urine culture